Clinical trial exclusion criterion:
Subjects on any other experimental treatment within 90 days of the first dose of study drug or who have not recovered from the side effects of such therapy

Annotated entities:
- Post-eligibility: "Subjects on any other experimental treatment within 90 days of the first dose of study drug or who have not recovered from the side effects of such therapy"
- Context_Error: "Subjects on any other experimental treatment within 90 days of the first dose of study drug or who have not recovered from the side effects of such therapy"